Clinical trial exclusion criterion:
Autoimmune hepatitis

Annotated entities:
- Condition: "Autoimmune hepatitis"